Clinical trial exclusion criterion:
Currently in active alcohol withdrawal

Annotated entities:
- Qualifier: "active"
- Condition: "alcohol withdrawal"
- Temporal: "Currently"